Active drug or alcohol use or dependence that would interfere with adherence to study requirements

The above is a clinical trial exclusion criterion. Annotated with entity spans:
[Temporal: Active] [Condition: drug] or [Condition: alcohol use] or dependence that [Qualifier: would interfere with adherence to study requirements]